胰蛋白酶（trypsin）不參與下列那種酵素的活化？
A. colipase
B. carboxypeptidase B
C. elastase
D. deoxyribonuclease

正確答案：D. deoxyribonuclease